Clinical trial exclusion criterion:
History of any chemotherapy for MBC.

Entity relations:
- causal("chemotherapy", "MBC")